Clinical trial inclusion criterion:
Men or women, 18 to 65 years old with a BMI of 35 kg/m2 or greater who will be undergoing bariatric surgery (VSG and RYGB)

Annotated entities:
- Person: "Men"
- Person: "women"
- Person: "old"
- Value: "18 to 65 years"
- Measurement: "BMI"
- Value: "35 kg/m2 or greater"
- Procedure: "bariatric surgery"
- Procedure: "VSG"
- Procedure: "RYGB"